Clinical trial exclusion criterion:
patients with child class B and C liver disease

Annotated entities:
- Measurement: "child class"
- Condition: "liver disease"
- Value: "B"
- Value: "C"